Clinical trial exclusion criterion:
Absence of documentation of age-appropriate cancer screening at the time of randomization

Annotated entities:
- Procedure: "cancer screening"
- Qualifier: "age-appropriate"
- Temporal: "at the time of randomization"
- Reference_point: "the time of randomization"